MADRS score > 20

The above is a clinical trial inclusion criterion. Annotated with entity spans:
[Measurement: MADRS score] [Value: > 20]